What conditions are diagnosed using the scratch collapse test?

Scales collapse test is used for the diagnosis of cts, cubital tunnel syndrome and carpal tunnel syndrome.